Clinical trial inclusion criterion:
Anticipated TPN treatment for at least one month

Annotated entities:
- Procedure: "TPN treatment"
- Multiplier: "for at least one month"